Clinical trial exclusion criterion:
9. Serum creatinine above ULN

Annotated entities:
- Parsing_Error: "9."
- Measurement: "Serum creatinine"
- Value: "above ULN"